78歲女性在準備進行心導管檢查前突然發生休克，影像學檢查顯示左心室壁破裂。緊急手術治療將破裂處修補後，病人狀況暫時穩定。下列何者最能代表破裂處心肌的病理變化？
A. transmural coagulative necrosis and neurophilic infiltration
B. myocardial hypertrophy with subendocardial zone coagulative necrosis
C. diffuse interstitial fibrosis and myocytolysis
D. mild waviness of myocytes

正確答案：A. transmural coagulative necrosis and neurophilic infiltration